Clinical trial exclusion criteria:
a history of non-standard treatment(chemotherapy or surgery)
secondary osteosarcoma or well-differentiated parosteal osteosarcoma
evident dysfunction of cardia,liver and kidney, or pregnant women or women during lactation

Annotated entities:
- Procedure: "non-standard treatment"
- Procedure: "chemotherapy"
- Procedure: "surgery"
- Temporal: "history"
- Condition: "secondary osteosarcoma"
- Condition: "parosteal osteosarcoma"
- Qualifier: "well-differentiated"
- Condition: "dysfunction of cardia"
- Condition: "dysfunction of kidney"
- Condition: "dysfunction of liver"
- Condition: "pregnant"
- Condition: "lactation"